Clinical trial inclusion criterion:
Patients 18 years of age or older with >3 unformed stools/24 hours with positive stool test for C. difficile.

Entity relations:
- Has_value("age", "or older 18 years")
- Has_multiplier("unformed stools", ">3")
- Has_temporal("unformed stools", "24 hours")
- Has_value("stool test", "positive")
- Has_qualifier("stool test", "C. difficile")